有關壓力（stress）造成身體主要反應之敘述，下列何者正確？
A. 會刺激交感神經系統分泌正腎上腺素，但不影響腎上腺分泌腎上腺素
B. 糖皮質素（glucocorticoid hormone）的分泌增加較正腎上腺素為快
C. 會刺激糖皮質素（glucocorticoid hormone）的分泌
D. 會刺激胰島素大量分泌

正確答案：C. 會刺激糖皮質素（glucocorticoid hormone）的分泌